Clinical trial exclusion criteria:
1. Deny to sign the informed consent;
2. type 1 diabetes;
3. Family history of hypertriglyceridemia or fasting triglyceride>4.56 mmol/L;
4. Have severe liver disease, kidney disease or cancer;
5. Participating in the other clinical trial within 30 days;
6. Other diseases or conditions, for which the doctor of the patients do not agree his or her participating.

Annotated entities:
- Post-eligibility: "Deny to sign the informed consent;"
- Non-query-able: "Deny to sign the informed consent;"
- Condition: "type 1 diabetes"
- Condition: "hypertriglyceridemia"
- Measurement: "fasting triglyceride"
- Value: ">4.56 mmol/L"
- Observation: "Family history"
- Qualifier: "severe"
- Condition: "liver disease"
- Condition: "kidney disease"
- Condition: "cancer"
- Context_Error: "Participating in the other clinical trial within 30 days;"
- Condition: "Other diseases"
- Condition: "Other conditions"
- Undefined_semantics: "Other diseases or conditions"
- Subjective_judgement: "for which the doctor of the patients do not agree his or her participating."
- Qualifier: "for which the doctor of the patients do not agree his or her participating"
- Non-query-able: "Other diseases or conditions, for which the doctor of the patients do not agree his or her participating."